La ATP sintasa mitocondrial:
1. Hidroliza ATP cuando los electrones pasan a través de su fracción F0.
2. Presenta un único centro catalítico.
3. Produce ATP empleando la energía de un gradiente de protones.
4. Sintetiza un 10% del ATP del organismo.

Respuesta correcta: 3. Produce ATP empleando la energía de un gradiente de protones.